Explain the action of Balovaptan.

Balovaptan is an orally administered small molecule that binds to mTORC1 and inhibits activation of the mTOR signalling pathway. It is approved for treatment of children with autism spectrum disorders.